Clinical trial exclusion criterion:
Investigational drugs/agents within 14 days of first dose of 852A

Entity relations:
- AND("within 14 days of first dose", "852A")
- Has_temporal("Investigational drugs/agents", "within 14 days of first dose")